Clinical trial exclusion criterion:
Has contact lens best corrected distance vision worse than 20/25 (0.10 logMAR) in either eye.

Annotated entities:
- Measurement: "contact lens best corrected distance vision"
- Value: "worse than 20/25 in either eye"
- Value: "worse than 0.10 logMAR in either eye"